Clinical trial exclusion criteria:
Patients with a history of an untreated malignancy (except local skin cancers)
Ischemic stroke (determined using the Questionnaire for Verifying Stroke-Free Status (QVSFS)
Patients on renal dialysis or with end-stage hepatic dysfunction
Acute infection/inflammation (Temperature > 101.5 F, and/or WBC> 15, 000)
Inability to obtain informed consent from patient or next of kin
Anticoagulant use (warfarin or heparin)

Annotated entities:
- Qualifier: "untreated"
- Condition: "malignancy"
- Condition: "local skin cancers"
- Negation: "except"
- Condition: "Ischemic stroke"
- Qualifier: "Questionnaire for Verifying Stroke-Free Status (QVSFS)"
- Procedure: "renal dialysis"
- Condition: "end-stage hepatic dysfunction"
- Qualifier: "Acute"
- Condition: "infection"
- Condition: "inflammation"
- Measurement: "Temperature"
- Measurement: "WBC"
- Value: "> 101.5 F"
- Value: "> 15, 000"
- Informed_consent: "Inability to obtain informed consent from patient or next of kin"
- Drug: "Anticoagulant"
- Drug: "warfarin"
- Drug: "heparin"